Clinical trial inclusion criterion:
Hepatitis B virus DNA not detectable(Roche Cobas).

Annotated entities:
- Measurement: "Hepatitis B virus DNA"
- Value: "not detectable"